En el modelo monocompartimental, la dosis de choque para un fármaco que sigue cinética lineal, se administra en dosis múltiples por vía oral y se absorbe de manera extraordinariamente rápida; se puede calcular como:
1. El cociente entre la dosis de mantenimiento y el intervalo de dosificación.
2. El producto de la dosis de mantenimiento por la constante de velocidad de absorción.
3. El cociente entre el intervalo de dosificación y la constante de velocidad de absorción.
4. El producto de la dosis de mantenimiento por el factor de acumulación.
5. El producto de la velocidad de dosificación por la constante de velocidad de absorción.

Respuesta correcta: 4. El producto de la dosis de mantenimiento por el factor de acumulación.